下列何種TNM分期的Lung cancer不適合以手術作為第一線治療？①T1N0M0 ②T1N1M0 ③T1N3M0  ④T3N1M0
A. 僅③
B. 僅③④
C. 僅②③④
D. 僅①②

正確答案：A. 僅③